What effect does Methylsulfonylmethane (MSM) have on inflammation?

These findings indicate that MSM may protect against inflammation in the heart